7. Pulse oximetry of > 90% on room air

The above is a clinical trial inclusion criterion. Annotated with entity spans:
[Parsing_Error: 7.] [Measurement: Pulse oximetry] of [Value: > 90%] on room air